History of deep venous thrombosis

The above is a clinical trial exclusion criterion. Annotated with entity spans:
[Temporal: History] of [Condition: deep venous thrombosis]